Clinical trial inclusion criterion:
AST < 10 x ULN

Annotated entities:
- Measurement: "AST"
- Value: "< 10 x ULN"